Clinical trial exclusion criterion:
Active prostatitis or urinary tract infection

Annotated entities:
- Condition: "prostatitis"
- Condition: "urinary tract infection"
- Temporal: "Active"